Which cancer types are associated with mutations in the TWIST1 gene?

Cancer is caused by uncontrolled cell division. Mutations in TWIST1 are associated with breast cancer, prostate cancer, lung cancer, and prostate cancer.